Clinical trial inclusion criterion:
Chronic pancreatitis requiring pancreatoduodenectomy

Annotated entities:
- Condition: "Chronic pancreatitis"
- Observation: "requiring"
- Procedure: "pancreatoduodenectomy"